What is the function of Taraxasterol  in rheumatoid arthritis?

Taraxasterol suppresses inflammation in rheumatoid arthritis.